Clinical trial exclusion criterion:
Pyonephrosis requiring drainage

Entity relations:
- Has_mood("drainage", "requiring")
- AND("Pyonephrosis", "drainage")